Which mutation is associated with PLMS (periodic limb movements in sleep)?

missense substitution, Met1Val (M1V), was identified in the DCX gene